Patients with allergy or intolerance to any of the drugs used.

The above is a clinical trial exclusion criterion. Annotated with entity spans:
Patients with [Condition: allergy] or [Condition: intolerance] to any of the [Drug: drugs] used.